Al registrar los datos obtenidos durante la ejecución de los cuidados, lo apropiado es:
1. Tomarse un tiempo para hacer las anotaciones, después de una reflexión basada en lo que se recuerde.
2. Centrarse en los problemas y acontecimientos importantes que comunican lo que es diferente ese día en esa persona.
3. Recoger todo lo que se ha percibido sobre la respuesta, aunque sea subjetivo, por ser una información importante para el equipo.
4. Registrar todas las manifestaciones normales que presenta la persona.
5. Realizar las anotaciones de manera general, sin describir concreciones temporales que dificultarían la interpretación.

Respuesta correcta: 2. Centrarse en los problemas y acontecimientos importantes que comunican lo que es diferente ese día en esa persona.